下列何者支配的肌肉數目最少？
A. 腓淺神經（superficial fibular nerve）
B. 腓深神經（deep fibular nerve）
C. 肌皮神經（musculocutaneous nerve）
D. 橈神經（radial nerve）

正確答案：A. 腓淺神經（superficial fibular nerve）